El número 0.0670 tiene:
1. 5 cifras significativas.
2. 4 cifras significativas.
3. 3 cifras significativas.
4. 2 cifras significativas.
5. 1 cifra significativa.

Respuesta correcta: 3. 3 cifras significativas.